正常情況下，體循環的動脈血氧分壓為 60 mmHg 時，血紅素氧飽和度（Hemoglobin saturation）約為：
A. 90%
B. 80%
C. 70%
D. 60%

正確答案：A. 90%